某研究者想檢定新藥是否有降血壓效果，對 20 隻大鼠在餵食新藥前後分別測量血壓值，對於兩次血壓測量值的比較，下列統計分析方法何者最恰當？
A. 線性迴歸（Linear regression）
B. 獨立樣本t檢定（Independent sample t-test）
C. 配對t檢定（Paired t-test）
D. 列聯表分析（Contingency table）

正確答案：C. 配對t檢定（Paired t-test）